Minimum of 12 natural teeth

The above is a clinical trial inclusion criterion. Annotated with entity spans:
[Multiplier: Minimum of 12] [Observation: natural teeth]